50 歲男性肝臟移植術後第七天，出現右上腹痛及輕微發燒，γ-GT、Alk-P 及 Bilirubin 有輕微上升，最可能的原因為何？
A. 肝門靜脈栓塞（Portal vein thrombosis）
B. Cytomegalovirus 感染
C. 新肝扭轉
D. 急性排斥（Acute rejection）

正確答案：D. 急性排斥（Acute rejection）